王伯伯 40 多年來每天抽菸兩包，在兩年前體檢被告知有早期肺氣腫，於是毅然戒掉抽菸的習慣。最近王伯伯因疝氣住院接受治療，住院醫師得知王伯伯成功戒菸的故事，希望他可以在醫院戒菸宣導影片中現身說法，便通知教材室的張專員在王伯伯出院前進行訪談及邀約拍片事宜。當張專員說明來意，王伯伯有些不高興，問張專員道：「您怎會知道我長年抽菸的事？」原來住院醫師沒有先知會王伯伯便請張專員到來。下列敘述何者是住院醫師的行為最主要的疏失？
A. 沒有準確地評估王伯伯對事件的反應
B. 輕忽地將王伯伯的隱私告知其他人員
C. 未考慮到張專員並不具醫療人員身分
D. 忘記先請社工人員事先進行充分溝通

正確答案：B. 輕忽地將王伯伯的隱私告知其他人員